Age greater than 18

The above is a clinical trial inclusion criterion. Annotated with entity spans:
[Person: Age] [Value: greater than 18]